Clinical trial inclusion criterion:
a cardioembolic event, which occurred on anticoagulation, or

Annotated entities:
- Condition: "cardioembolic event"
- Drug: "anticoagulation"
- Temporal: "occurred on anticoagulation"